Clinical trial inclusion criteria:
HBsAg and HBeAg positive for more than 6 months, HBV DNA detectable with ALT level abnormal lasted for three months and at least time190 IU/L or liver puncture biopsy demonstrated apparent inflammation, never treated before enrolled.

Annotated entities:
- Condition: "HBeAg positive"
- Condition: "HBsAg positive"
- Temporal: "for more than 6 months"
- Condition: "HBV DNA detectable"
- Measurement: "ALT level"
- Value: "abnormal"
- Temporal: "lasted for three months"
- Temporal: "at least time"
- Value: "190 IU/L"
- Procedure: "liver puncture biopsy"
- Condition: "inflammation"
- Negation: "never"
- Procedure: "treated"
- Temporal: "before enrolled"